Clinical trial inclusion criterion:
Non-smoker for one year or more

Entity relations:
- Has_negation("smoker", "Non")
- Has_temporal("smoker", "for one year or more")